一位 75 歲女性，因昏迷而被送入院，其血清鈉（sodium）被發現為 105 mEq/L。病史問起來，家中沒人照顧，昏迷可能有幾天之久了，提高血清鈉時需注意於第一天內（24 小時內）提高血清鈉不可超過多少？
A. 12 mEq/L
B. 20 mEq/L
C. 24 mEq/L
D. 30 mEq/L

正確答案：A. 12 mEq/L